下列有關椎間盤突出症導致下背痛病人的衛教，何者錯誤？
A. 避免太多彎腰的姿勢
B. 如長時間需維持在坐姿，建議每 20 分鐘起身稍做活動
C. 可長時間開車而不需 20 至 30 分鐘休息做拉筋伸展運動
D. 可做背部肌肉的肌力加強及拉筋伸展運動以改善背痛

正確答案：C. 可長時間開車而不需 20 至 30 分鐘休息做拉筋伸展運動